Clinical trial inclusion criterion:
Previously taken one or more statins

Entity relations:
- Has_multiplier("statins", "one or more")